What is the function of kisspeptin in the brain?

Kisspeptin is a leptin-like protein that exerts important effects on the regulation of food intake and energy expenditure by interacting with the glucocorticoid receptor in the brain.